El indicador negro de eriocromo T (N.E.T.) presenta los siguientes colores en función del pH:
1. H2In¯rojo, HIn2- azul, In3- naranja y cuando forma complejo con metal es rojo.
2. H2In¯azul, HIn2- rojo, In3- naranja y cuando forma complejo con metal es rojo.
3. H2In¯rojo, HIn2- azul, In3- rojo vino y cuando forma complejo con metal es naranja.
4. H2In¯rojo, HIn2- naranja, In3- azul y cuando forma complejo con metal es naranja.
5. H2In¯azul, HIn2- naranja, In3- rojo y cuando forma complejo con metal es naranja.

Respuesta correcta: 1. H2In¯rojo, HIn2- azul, In3- naranja y cuando forma complejo con metal es rojo.